一位 25 歲女性，主訴無月經 3 個月，體重上升 2 公斤，偶有噁心，超音波下無特殊異常，給予 medroxyprogesterone acetate 10 mg 5 天，停藥後 2 天出現陰道出血。下列診斷何者最適合？
A. 懷孕
B. 無排卵
C. 內生性雌激素不足
D. 子宮內膜沾黏

正確答案：B. 無排卵